history of systemic or ocular thromboembolic events.

The above is a clinical trial exclusion criterion. Annotated with entity spans:
history of [Qualifier: systemic] or [Qualifier: ocular] [Condition: thromboembolic events].